舊船解體勞工，因疲勞、全身無力、腹痛就醫，門診檢查時出現腕垂症（wrist drop）等手足伸肌 （extensor muscle）無力的病變，他最可能罹患了何種金屬的中毒？
A. 鉛
B. 鎘
C. 汞
D. 錳

正確答案：A. 鉛